Clinical trial exclusion criterion:
Known allergy to one of the study drugs

Annotated entities:
- Condition: "allergy"
- Drug: "study drugs"